What is Uhl's anomaly?

uhl's anomaly is an extremely rare cardiac defect characterized by absence of the myocardium of the right ventricle.